22. Clinically unacceptable result at the screening physical examination

The above is a clinical trial exclusion criterion. Annotated with entity spans:
[Parsing_Error: 22.] [Condition: Clinically unacceptable result] [Temporal: at the screening physical examination]